3. impaired glucose homeostasis (fasting plasma glucose concentration of 110 mg⁄dL or greater or glucose of 140 mg⁄dL or greater after OGTT or

The above is a clinical trial inclusion criterion. Annotated with entity spans:
3. [Condition: impaired glucose homeostasis] ([Measurement: fasting plasma glucose concentration] of [Value: 110 mg⁄dL or greater] or [Measurement: glucose] of [Value: 140 mg⁄dL or greater] [Temporal: after OGTT] or